previous allergic reaction to antibiotics (bismuth, amoxicillin, metronidazole, clarithromycin, tetracycline) and PPI (esomeprazole),

The above is a clinical trial inclusion criterion. Annotated with entity spans:
[Temporal: previous] [Condition: allergic reaction] to [Drug: antibiotics] ([Drug: bismuth], [Drug: amoxicillin], [Drug: metronidazole], [Drug: clarithromycin], [Drug: tetracycline]) and [Drug: PPI] ([Drug: esomeprazole]),